人體組織對缺氧的耐受性不同，下列何者耐受性最差？
A. 皮膚
B. 皮下組織
C. 肌肉
D. 周邊神經

正確答案：C. 肌肉